Clinical trial exclusion criterion:
pain or other disorders precluding their participation.

Annotated entities:
- Condition: "pain"
- Condition: "other disorders"
- Qualifier: "precluding their participation"
- Post-eligibility: "pain or other disorders precluding their participation"